Clinical trial exclusion criterion:
Patients who meet DSM-IV-TR criteria for any significant current substance abuse;

Annotated entities:
- Condition: "substance abuse"
- Measurement: "DSM-IV-TR"